Clinical trial exclusion criterion:
History of hypersensitivity for bevacizumab.

Entity relations:
- AND("hypersensitivity", "bevacizumab")
- Has_temporal("hypersensitivity", "History")